一個 28 歲的男性，從四樓陽台掉落，到急診室時 Glasgow Coma Scale（GCS）是 8 分。心跳 110 bpm、血壓 150/90 mmHg（平均動脈壓 110 mmHg）和呼吸 18 bpm。血清酒精濃度是 150 mg/dL。病患是在急診室裡接受插管後，送至放射科做頭部電腦斷層掃描。頭部電腦斷層掃描呈現左硬腦膜下血腫和顱骨基底部骨折。假設顱內壓為 25 mmHg，則腦灌注壓（cerebral perfusion pressure）為多少 mmHg？
A. 85
B. 70
C. 50
D. 100

正確答案：A. 85